Clinical trial exclusion criterion:
Any change in psychotropic medication (including change in dosage) between screening and baseline;

Annotated entities:
- Procedure: "psychotropic medication"